Clinical trial exclusion criterion:
The American Society of Anesthesiologists (ASA) score > 3

Entity relations:
- Has_value("American Society of Anesthesiologists (ASA) score", "> 3")